Clinical trial exclusion criterion:
Patients who received chemotherapy less than 6 weeks ago.

Entity relations:
- Has_temporal("chemotherapy", "less than 6 weeks ago")